Clinical trial exclusion criterion:
Evidence of blood dyscrasia

Annotated entities:
- Condition: "blood dyscrasia"
- Mood: "Evidence"